Clinical trial exclusion criterion:
Unstable medical illness that requires immediate medical care

Annotated entities:
- Non-query-able: "Unstable medical illness that requires immediate medical care"